El plasma ICP es más adecuado para el análisis multielemental rápido que los métodos de absorción atómica con llama porque:
1. El intervalo de linealidad no es amplio, lo que permite hacer análisis muy sensibles.
2. El ICP dispone de varias posibilidades para introducir la muestra empleando diferentes tipos de nebulizadores.
3. Utilizan dos tubos fotomultiplicadores, uno para la región ultravioleta y otro para el visible.
4. Dispone de detectores de estado sólido de silicio de acoplamiento de carga que permiten la monitorización simultánea de un número elevado de líneas, reduciendo el tiempo de análisis, el volumen de muestra y mejorando los límites de detección.
5. No es correcto, pues con el plasma ICP no se pueden hacer análisis multielementales.

Respuesta correcta: 4. Dispone de detectores de estado sólido de silicio de acoplamiento de carga que permiten la monitorización simultánea de un número elevado de líneas, reduciendo el tiempo de análisis, el volumen de muestra y mejorando los límites de detección.